History of previous cesarean delivery

The above is a clinical trial exclusion criterion. Annotated with entity spans:
[Temporal: History] of [Temporal: previous] [Procedure: cesarean delivery]